Clinical trial exclusion criterion:
Patients under chronic use of medications

Annotated entities:
- Multiplier: "chronic use"
- Drug: "medications"